Clinical trial inclusion criterion:
HbA1c < 75 mmol/mol (9.0%)

Entity relations:
- Has_value("HbA1c", "< 75 mmol/mol")
- Subsumes("< 75 mmol/mol", "9.0%")